Clinical trial exclusion criterion:
cardiac or non-cardiac illness with life expectancy of less than two years;

Entity relations:
- Has_value("life expectancy", "less than two years")
- OR("cardiac illness", "non-cardiac illness")